Clinical trial inclusion criterion:
Possibility to restore a functional occlusion with a minimum of four occlusal units (i.e. pairs of occluding posterior teeth).

Annotated entities:
- Post-eligibility: "Possibility to restore a functional occlusion with a minimum of four occlusal units (i.e. pairs of occluding posterior teeth)"